Clinical trial inclusion criterion:
Patients who require a central venous line to receive PN or already have a central venous line in place for other reasons

Annotated entities:
- Device: "central venous line"
- Procedure: "PN"
- Device: "central venous line"
- Observation: "other reasons"